Clinical trial exclusion criterion:
3. Women who are pregnant or are attempting conception, especially in the presence of a history of recurrent spontaneous abortion.

Entity relations:
- Has_temporal("spontaneous abortion", "recurrent")